Allergy, sensitivity, or absolute contraindications to any of the medications involved in the study

The above is a clinical trial exclusion criterion. Annotated with entity spans:
[Condition: Allergy], [Condition: sensitivity], or absolute [Condition: contraindications] to any of the [Drug: medications] involved in the [Qualifier: study]